新生兒抽搐（neonatal seizure）以下列何種原因最常見？
A. 低血糖
B. 低血鈣
C. 敗血症合併腦膜炎
D. 缺氧及缺血腦病變

正確答案：D. 缺氧及缺血腦病變